Clinical trial inclusion criterion:
18-80 years old;

Entity relations:
- Has_value("old", "18-80 years old")